一位三歲半男童，誤食奶奶做鹼粽剩下的鹼油（pH 值為 12），產生嘔吐、嘴巴潰爛現象。下列何者最正確？
A. 考慮為強鹼引起的腐蝕性食道炎，應該趕快給予酸性水液，以酸鹼中和
B. 口咽（oropharynx）無腐蝕病灶時，表示食道胃部無受損
C. 一般不會同時發生腐蝕性胃炎
D. 部分病人會發生食道狹窄合併症

正確答案：D. 部分病人會發生食道狹窄合併症